一位 30 歲肥胖女性有相當固定每日搏動性頭痛（throbbing headache）3 個月病史，伴隨間斷性短暫視覺模糊（graying out），神經檢查發現除了雙側視乳突水腫（papilledema）外，其餘皆正常。下列那一項是可能的診斷？
A. 慢性每日型頭痛（chronic daily headache）
B. 假性腦部腫瘤症（pseudotumor cerebri）
C. 叢發性頭痛（cluster headaches）
D. 偏頭痛（migraine）

正確答案：B. 假性腦部腫瘤症（pseudotumor cerebri）